Current tobacco use.

The above is a clinical trial exclusion criterion. Annotated with entity spans:
[Temporal: Current] [Observation: tobacco use].